Sildenafil (Viagra), tadalafil (Cialis), vardenafil (Levitra), and avanafil (Stendra) will not be permitted during the study drug dose Titration Period, because of increased risk of hypotension in combination with alpha-1 blockers, but will be allowed at half the usual starting dose following the study drug dose Titration Period, per VA prescribing guidelines.

The above is a clinical trial exclusion criterion. Annotated with entity spans:
[Drug: Sildenafil] ([Drug: Viagra]), [Drug: tadalafil] ([Drug: Cialis]), [Drug: vardenafil] ([Drug: Levitra]), and [Drug: avanafil] ([Drug: Stendra]) will not be permitted [Temporal: during the study drug dose Titration Period], because of increased risk of hypotension in combination with alpha-1 blockers, but will be allowed at half the usual starting dose following the study drug dose Titration Period, per VA prescribing guidelines.